Clinical trial inclusion criterion:
Diagnosis of diabetes mellitus

Annotated entities:
- Condition: "diabetes mellitus"